Clinical trial exclusion criterion:
23. Hemoglobin concentration <9 g/dL at Screening.

Entity relations:
- Has_value("Hemoglobin concentration", "<9 g/dL")
- Has_index("at Screening", "Screening")
- Has_temporal("Hemoglobin concentration", "at Screening")